Clinical trial exclusion criterion:
Gastrointestinal disease or with gastrointestinal surgical history which can affect the absorption of the investigational product.

Annotated entities:
- Condition: "Gastrointestinal disease"
- Temporal: "gastrointestinal surgical history"
- Procedure: "gastrointestinal surgical"
- Qualifier: "affect the absorption of the investigational product"
- Context_Error: "affect the absorption of the investigational product"
- Undefined_semantics: "affect the absorption of the investigational product"